Clinical trial inclusion criterion:
Patients aged 19 or older

Entity relations:
- Has_value("aged", "19 or older")